Clinical trial exclusion criterion:
Contraindication to anticoagulation (i.e., heparin, warfarin or another commercially available anticoagulation medication)

Annotated entities:
- Condition: "Contraindication"
- Drug: "anticoagulation"
- Drug: "heparin"
- Drug: "warfarin"
- Non-query-able: "nother commercially available anticoagulation medication"